目前現代化的精神醫療，下列何種治療最少施用於精神分裂症患者？
A. 多巴胺受體拮抗劑（Dopamine receptor antagonist）
B. 額葉截開術（Frontal lobotomy）
C. 團體心理治療（Group psychotherapy）
D. 職能治療（Vocational therapy）

正確答案：B. 額葉截開術（Frontal lobotomy）